Los procedimientos de reforzamiento diferencial para el tratamiento de menores con comportamientos agresivos:
1. Suponen una forma de control de los antecedentes de la conducta.
2. Incluyen el reforzamiento de omisión.
3. Implican aislar al niño en una esquina de la sala.
4. Consisten en reducir la estimulación aversiva.

Respuesta correcta: 2. Incluyen el reforzamiento de omisión.